Clinical trial exclusion criterion:
Life expectancy less than 6 months

Entity relations:
- Has_value("Life expectancy", "less than 6 months")